Which are the cardiac manifestations of Marfan syndrome?

Cardiac manifestations of Marfan syndrome include aortic root dilation,aortic regurgitation, mitral valve prolapse and mitral valve regurgitation.